食道癌切除重建，以那一器官最常被使用？
A. 大腸
B. 胃
C. 空腸
D. 肌皮瓣

正確答案：B. 胃